What percentage of C. elegans genes reside in operons?

Approximately 15% of the genes in C. elegans are located in operons.